Clinical trial inclusion criterion:
7. No Serious Cardiac,Pulmonary,Hepatic and Nephritic disease

Annotated entities:
- Condition: "Nephritic disease"
- Condition: "Hepatic"
- Condition: "Pulmonary"
- Condition: "Cardiac"
- Negation: "No"
- Condition: "Cardiac,Pulmonary,Hepatic"